8. Has an IUD in place

The above is a clinical trial exclusion criterion. Annotated with entity spans:
[Parsing_Error: 8.] Has an [Device: IUD] in place